Clinical trial exclusion criterion:
Severe disease with a life expectancy of less than 3 months;

Entity relations:
- Has_value("life expectancy", "less than 3 months")
- Has_qualifier("disease", "Severe")
- Has_context("disease", "life expectancy")